Clinical trial inclusion criterion:
Patients must have adequate hepatic function as documented by a serum bilirubin less than or equal to 2x the institutional upper limit of normal, regardless of whether patients have liver involvement secondary to tumor. Patients may not have ascites or the ascites must be responsive to diuretics.

Entity relations:
- Has_value("hepatic function", "adequate")
- Has_value("serum bilirubin", "less than or equal to 2x the institutional upper limit of normal")
- AND("hepatic function", "serum bilirubin")
- Has_negation("ascites", "may not have")
- Has_qualifier("ascites", "responsive to diuretics")